Clinical trial inclusion criteria:
First or second single kidney (cadaveric or living donors) transplant recipients.
Considered for a standard immunosuppressive protocol.
Must be capable of giving written informed connect for participation in the study for 24 months.

Annotated entities:
- Procedure: "transplant second single kidney"
- Procedure: "First single kidney transplant"
- Qualifier: "cadaveric donors"
- Qualifier: "living donors"
- Mood: "Considered for"
- Procedure: "standard immunosuppressive protocol"
- Post-eligibility: "Must be capable of giving written informed connect for participation in the study for 24 months."